Clinical trial exclusion criterion:
PN in the last 7 days prior to study enrollment.

Annotated entities:
- Procedure: "PN"
- Temporal: "in the last 7 days prior to study enrollment"
- Reference_point: "study enrollment"